Acute illness

The above is a clinical trial inclusion criterion. Annotated with entity spans:
[Condition: Acute illness]